Clinical trial exclusion criterion:
Suspected or confirmed active TB disease

Annotated entities:
- Condition: "active TB"